Clinical trial exclusion criterion:
Hydrosalpinx.

Annotated entities:
- Condition: "Hydrosalpinx"